一位 5 個月大的男孩，父母發現他在剛睡醒時常會有一陣陣全身抽動現象，每隔幾秒就抽動一次，一連串的發作甚至可達 3 至 5 分鐘。下列敘述何者錯誤？
A. ACTH、corticosteroid 或 benzodiazepine drugs 是常用的治療藥物
B. 最可能的診斷是 West syndrome
C. 90%以上的病患在 1 歲後會逐漸康復痊癒
D. Hypsarrhythmia 為其特徵性之腦電圖（EEG）表現

正確答案：C. 90%以上的病患在 1 歲後會逐漸康復痊癒